Clinical trial exclusion criterion:
Patients that are immunologically compromised, or receiving chronic steroids (>30 days), excluding inhalers

Annotated entities:
- Condition: "immunologically compromised"
- Drug: "steroids"
- Qualifier: "chronic"
- Temporal: ">30 days"
- Negation: "excluding"
- Drug: "inhalers"